在運動控制的階層中，下列何者屬於最下階的執行層級？
A. 脊髓
B. 基底核
C. 小腦
D. 大腦的初級運動皮層（primary motor cortex）

正確答案：A. 脊髓